Clinical trial exclusion criterion:
Alcohol or drug dependency

Annotated entities:
- Condition: "drug dependency"
- Condition: "Alcohol dependency"